Clinical trial exclusion criterion:
Evidence of HCC

Entity relations:
- Has_mood("HCC", "Evidence")